Clinical trial inclusion criteria:
• All patients attending for a routine diagnostic endoscopic procedure at St Mary's Hospital NHS Trust for dyspepsia and abdominal pain

Annotated entities:
- Condition: "dyspepsia"
- Condition: "abdominal pain"
- Procedure: "diagnostic endoscopic procedure"
- Visit: "St Mary's Hospital NHS Trust"